American Society of Anesthesiology (ASA) physical status class 1-3

The above is a clinical trial inclusion criterion. Annotated with entity spans:
[Measurement: American Society of Anesthesiology] ([Measurement: ASA]) physical status class [Value: 1-3]